Clinical trial exclusion criterion:
Significant pulmonary disease, (e.g., restrictive pulmonary disease, constrictive or COPD) or any other disease or malfunction of the lungs or respiratory system that produces chronic symptoms

Annotated entities:
- Condition: "pulmonary disease"
- Qualifier: "Significant"
- Condition: "restrictive pulmonary disease"
- Condition: "COPD"
- Non-query-able: "any other disease or malfunction of the lungs or respiratory system that produces chronic symptoms"